在進行腹腔鏡膽囊切除（laparoscopic cholecystectomy）中，為防止膽管損傷（bile duct injury），下列那一項不是將腹腔鏡手術轉成開腹手術（convert to open）的主要因素？
A. 手術過程無進展（operation is not progressing）
B. 解剖構造不清楚（anatomy in doubt）
C. 膽道攝影無法明確顯示解剖構造（cholangiogram does not clearly define anatomy）
D. 膽囊壞疽（gallbladder gangrene）

正確答案：D. 膽囊壞疽（gallbladder gangrene）